Spinal Cord injury at or above L5

The above is a clinical trial inclusion criterion. Annotated with entity spans:
[Condition: Spinal Cord injury] [Qualifier: at or above L5]